Clinical trial exclusion criterion:
Total bilirubin > 3 mg/dL.

Annotated entities:
- Measurement: "Total bilirubin"
- Value: "> 3 mg/dL"